Clinical trial exclusion criterion:
eGFR<40 ml/min at time of possible conversion

Entity relations:
- Has_value("eGFR", "<40 ml/min")
- Has_temporal("eGFR", "at time of possible conversion")